Clinical trial exclusion criterion:
Thunderclap onset of the headache

Entity relations:
- AND("headache", "Thunderclap onset")